對於接受抗癲癎藥物治療的癲癎婦女患者，可建議在受孕期前後（periconceptional period）補充下列何種維生素，來降低胎兒發育異常（如：唇顎裂、神經管缺損、先天性心臟缺損等）的發生機會？
A. 維生素B6
B. 維生素C
C. 葉酸（folic acid）
D. 維生素B1

正確答案：C. 葉酸（folic acid）